Female patients older than 18 years.

The above is a clinical trial inclusion criterion. Annotated with entity spans:
[Person: Female] patients [Value: older than 18 years].